Clinical trial exclusion criterion:
3. Clinical evidence of severe bleeding disorder. Patients with mild bleeding disorders such as type 1 von Willebrand disease, mild platelet function defects such as platelet storage pool or release defects, and patients with bleeding due to Ehlers Danlos syndrome WILL be eligible to participate in the study.

Entity relations:
- Subsumes("mild platelet function defects", "platelet release defects")
- AND("bleeding", "Ehlers Danlos syndrome")
- Has_qualifier("bleeding disorder", "severe")
- Has_qualifier("bleeding disorders", "mild")
- Subsumes("bleeding disorders", "type 1 von Willebrand disease")
- OR("platelet release defects", "platelet storage pool defects")
- OR("type 1 von Willebrand disease", "mild platelet function defects")
- OR("bleeding disorder", "bleeding disorders")